Hemodynamically stable and appropriate for induction of labor as per primary clinical health team in house

The above is a clinical trial inclusion criterion. Annotated with entity spans:
[Condition: Hemodynamically stable] and appropriate for [Procedure: induction of labor] as per primary clinical health team in house